Clinical trial inclusion criterion:
Male or female subjects, aged >=40 years. Females must be of Non Child Bearing Potential. The definition of Non Child Bearing Potential is as following: Females, regardless of their age, with functioning ovaries and who have a current documented tubal ligation or hysterectomy, or females who are post-menopausal.

Entity relations:
- Has_value("aged", ">=40 years")
- Has_negation("Child Bearing Potential", "Non")
- AND("Females", "Child Bearing Potential")
- Has_negation("Child Bearing Potential", "Non")
- Subsumes("Child Bearing Potential", "Females")
- OR("Male", "female")
- OR("tubal ligation", "hysterectomy")
- OR("Females", "post-menopausal")
- OR("functioning ovaries", "post-menopausal")
- OR("tubal ligation", "post-menopausal")